Clinical trial inclusion criterion:
1. Stage 4 colon cancer either s/p metastasectomy or post-initial chemotherapy or maintenance "standard of care", either involving 5-fluorouracil/leucovorin (5-FU/LV) alone or continual bevacizumab alone. Patients in maintenance cohort must have had 2 consecutive CT scans showing stable disease and not be experiencing significant prior treatment-related toxicity above Grade 1.

Entity relations:
- Has_qualifier("colon cancer", "Stage 4")
- AND("maintenance "standard of care"", "5-fluorouracil/leucovorin (5-FU/LV)")
- Has_multiplier("CT scans", "2")
- Has_negation("treatment-related toxicity", "not")
- Has_temporal("treatment-related toxicity", "prior")
- Has_qualifier("disease", "stable")
- OR("5-fluorouracil/leucovorin (5-FU/LV)", "bevacizumab")
- OR("s/p metastasectomy", "post-initial chemotherapy", "maintenance "standard of care"")